Clinical trial inclusion criterion:
Patients must have a VAS (Visual analog scale) >=40mm

Entity relations:
- Has_value("VAS (Visual analog scale)", ">=40mm")